Clinical trial inclusion criterion:
Increased waist circumference (=102 cm in men; =88 cm in women)

Entity relations:
- Has_value("waist circumference", "Increased")
- Has_value("women", "=88 cm")
- Has_value("men", "=102 cm")
- Subsumes("Increased", "men")
- OR("men", "women")